Clinical trial inclusion criterion:
Scheduled for arthroscopic labral repair with or without osteoplasty of the hip.

Entity relations:
- Has_qualifier("osteoplasty", "hip")
- Has_mood("arthroscopic labral repair", "Scheduled")
- AND("arthroscopic labral repair", "osteoplasty")